¿Cuál de los siguientes agonistas de receptores adrenérgicos tiene efecto hipotensor?
1. Dopamina.
2. Clonidina.
3. Terbutalina.
4. Efedrina.

Respuesta correcta: 2. Clonidina.